Clinical trial exclusion criterion:
Participating in another study involving an investigational medication

Annotated entities:
- Competing_trial: "Participating in another study involving an investigational medication"